黃體（corpus luteum）主要是由何種細胞組成？
A. 顆粒細胞（granulosa cells）
B. 膜細胞（theca cells）
C. 纖維組織母細胞（fibroblasts）
D. 肌肉細胞（muscle cells）

正確答案：A. 顆粒細胞（granulosa cells）